In line with clinical stage I / II stage (T1-2 N0 M0; AJCC 2010) and receiving surgical resection

The above is a clinical trial inclusion criterion. Annotated with entity spans:
In line with [Condition: clinical stage I] / II stage ([Measurement: T][Value: 1-2] [Measurement: N][Value: 0] [Measurement: M][Value: 0]; AJCC 2010) and receiving [Procedure: surgical resection]